Patients able to complete trial procedures

The above is a clinical trial inclusion criterion. Annotated with entity spans:
[Post-eligibility: Patients able to complete trial procedures]